All patients who cannot participate in an outpatient physical therapy program for 3 days per week after surgery

The above is a clinical trial exclusion criterion. Annotated with entity spans:
All patients who [Negation: cannot] participate in an [Visit: outpatient] [Procedure: physical therapy] program [Temporal: for 3 days per week after surgery]